下列有關典型的亨丁頓氏舞蹈症（Huntington's chorea）的敘述，何者錯誤？
A. 豆狀核萎縮
B. 中年出現失智或類似精神分裂病的症狀
C. 側腦室變小
D. 有些病患的運動障礙為僵硬型（rigid）

正確答案：C. 側腦室變小